Clinical trial exclusion criterion:
Any patient whose condition will not allow for placement of the electrode PadSet.

Annotated entities:
- Condition: "condition"
- Negation: "not"
- Mood: "allow"
- Procedure: "placement"
- Device: "electrode PadSet"